What is the phenomenon of gene kissing?

Clustering of genes with similar expression patterns constitutes a phenomenon sometimes called "gene kissing."